Los cuatro principios de la bioética, no maleficencia, beneficencia, justicia y autonomía fueron propuestos:
1. Por Beauchamp y Childress.
2. En el Informe Belmont.
3. En el Convenio de Oviedo.
4. En la Declaración Universal de los Derechos Humanos.
5. Por Diego Gracia.

Respuesta correcta: 1. Por Beauchamp y Childress.